54歲男性因嚴重高血壓合併低血鉀症多次來急診室處理，初步診斷疑有hyperaldosteronism，手術前的病灶定位以何者之敏感性（sensitivity）最高？
A. 超音波掃描
B. 電腦斷層掃描
C. 鉈掃描（thallium-201 scan）
D. 血管造影術

正確答案：B. 電腦斷層掃描